有一孕期28週出生的早產兒，出院後小寶寶之發展追蹤評估中，若有下列那一項發現，需轉介兒童發展聯合評估中心做進一步處置？
A. 出生後2個月仍無有意義的微笑（smile）
B. 出生後5個月仍不會翻身（roll over）
C. 出生後2個月脖子仍無法穩定的撐起頭
D. 出生後13個月仍無法在輔助下以下肢支撐身體站立起來

正確答案：D. 出生後13個月仍無法在輔助下以下肢支撐身體站立起來